High risk for thromboembolic events (i.e., CHADS2 score = 2 or CHA2DS2-VASc score = 3) and require OAT before undergoing cardiac ablation

The above is a clinical trial inclusion criterion. Annotated with entity spans:
[Value: High] [Observation: risk for thromboembolic events] (i.e., [Measurement: CHADS2 score] [Value: = 2] or [Measurement: CHA2DS2-VASc score] [Value: = 3]) and require [Drug: OAT] [Temporal: before undergoing cardiac ablation]